在游泳池或淡水湖中從事水上育樂活動，通常較不易因此得到的感染是下列何症？
A. 梨形鞭毛蟲症（giardiasis）
B. 隱孢子蟲症（cryptosporidiosis）
C. 原發性阿米巴腦膜腦炎（primary amebic meningoencephalitis）
D. 腸道肉孢子蟲症（intestinal sarcosporidiasis）

正確答案：D. 腸道肉孢子蟲症（intestinal sarcosporidiasis）